Clinical trial exclusion criterion:
History of previous Hepatitis B vaccination(s)

Annotated entities:
- Procedure: "Hepatitis B vaccination"